Clinical trial inclusion criterion:
2. Clinical diagnosis of type 1 diabetes for at least one year.

Annotated entities:
- Parsing_Error: "2."
- Condition: "type 1 diabetes"
- Temporal: "for at least one year"